Clinical trial exclusion criterion:
4. Inability or unwillingness of a participant and/or guardian to provide informed consent

Annotated entities:
- Non-query-able: "Inability or unwillingness of a participant and/or guardian to provide informed consent"
- Post-eligibility: "Inability or unwillingness of a participant and/or guardian to provide informed consent"